Clinical trial exclusion criterion:
7. Meet current DSM V criteria for moderate to severe substance use disorder (excluding nicotine), smoke daily, or urine toxicology positive for any illicit substance inconsistent with history given.

Annotated entities:
- Parsing_Error: "7."
- Measurement: "DSM V criteria"
- Qualifier: "moderate to severe"
- Condition: "substance use disorder"
- Drug: "nicotine"
- Negation: "excluding"
- Observation: "smoke daily"
- Measurement: "urine toxicology"
- Value: "positive"
- Drug: "illicit substance"
- Qualifier: "inconsistent with history"
- Subjective_judgement: "inconsistent with history"
- Undefined_semantics: "urine toxicology"
- Undefined_semantics: "illicit substance"
- Value: "Meet"